Clinical trial exclusion criterion:
Subjects with serious acute or chronic disease involved liver, kidney, and brain or have to use potent CYP3A4-inhibitor or nitrate to treat the underlying diseases.

Entity relations:
- Has_temporal("chronic disease involved liver", "acute")
- Has_qualifier("chronic disease involved liver", "serious")
- Has_qualifier("CYP3A4-inhibitor", "potent")
- AND("CYP3A4-inhibitor", "underlying diseases")
- OR("chronic disease involved liver", "chronic disease involved brain", "chronic disease involved kidney")
- OR("CYP3A4-inhibitor", "nitrate")